Clinical trial exclusion criterion:
(2) Female infertility due to surgery (no ovaries and / or uterus)

Entity relations:
- Has_qualifier("infertility", "due to surgery")
- Subsumes("infertility", "no ovaries")
- OR("no ovaries", "no uterus")